Atrial fibrillation or flutter on electrocardiogram

The above is a clinical trial inclusion criterion. Annotated with entity spans:
[Condition: Atrial fibrillation] or flutter on [Procedure: electrocardiogram]